Elevated liver enzymes at baseline blood test

The above is a clinical trial inclusion criterion. Annotated with entity spans:
[Value: Elevated] [Measurement: liver enzymes] at [Temporal: baseline] [Procedure: blood test]